Clinical trial inclusion criterion:
obstructive sleep apnea or recurrent throat infections

Entity relations:
- Has_multiplier("throat infections", "recurrent")
- OR("obstructive sleep apnea", "throat infections")